Clinical trial inclusion criterion:
Straining during =25% of defecations

Entity relations:
- AND("Straining", "defecations")
- Has_multiplier("defecations", "=25%")